下列何者為肝臟粒線體內的HMG-CoA synthase的主要功能？
A. 促進膽固醇合成（cholesterol biosynthesis）
B. 抑制脂肪酸合成（fatty acid biosynthesis）
C. 促進酮體合成（ketone body biosynthesis）
D. 促進糖質新生（gluconeogenesis）

正確答案：C. 促進酮體合成（ketone body biosynthesis）